Clinical trial exclusion criterion:
Positive hepatitis B surface antigen, positive hepatitis C antibody or positive HIV test at screening or a history of positive testing (e.g. liver biopsy, serology) suggesting acute or chronic hepatitis.

Entity relations:
- Has_value("hepatitis B surface antigen", "Positive")
- Has_value("HIV test", "positive")
- Has_value("hepatitis C antibody", "positive")
- Has_index("at screening", "screening")
- Has_value("testing", "positive")
- Subsumes("testing", "liver biopsy")
- AND("testing", "acute hepatitis")
- Has_temporal("testing", "history")
- Subsumes("testing", "serology")
- OR("hepatitis B surface antigen", "hepatitis C antibody", "HIV test")
- OR("acute hepatitis", "chronic hepatitis")
- OR("hepatitis B surface antigen", "testing")